Obstructive uropathy

The above is a clinical trial inclusion criterion. Annotated with entity spans:
[Condition: Obstructive uropathy]